¿Cuál de las siguientes afirmaciones en relación al estreñimiento en el paciente terminal es correcta?:
1. Es un síntoma poco frecuente.
2. Su causa más común es la administración de opioides.
3. La terapia de base consistirá en la administración de enemas.
4. Su etiología es unifactorial.
5. Debe tratarse con dieta rica en fibra.

Respuesta correcta: 2. Su causa más común es la administración de opioides.